Clinical trial exclusion criterion:
Subjects who had a hypersensitivity to antibiotics or antimycotics

Entity relations:
- AND("hypersensitivity", "antibiotics")
- OR("antibiotics", "antimycotics")